Clinical trial exclusion criterion:
Patients with right-to-left, bi-directional, or transient right-to-left cardiac shunts

Annotated entities:
- Qualifier: "right-to-left,"
- Qualifier: "bi-directional"
- Qualifier: "transient"
- Qualifier: "right-to-left"
- Condition: "cardiac shunts"